Clinical trial exclusion criterion:
Moderate or severe endometriosis.

Entity relations:
- Has_qualifier("endometriosis", "Moderate")
- OR("Moderate", "severe")